69 周小姐經常感到疲倦、食慾不振、長期失眠、工作能力低落、人生乏味等不適，有數年之久。做過很多檢查都查不出器質性原因，被認為是神經衰弱。雖然大部分日子都感到身體與精神不好，但多 年來沒有明顯變化。根據精神疾病診斷與統計手冊第四版（DSM-IV），最可能的診斷是：
A. 重度憂鬱症（major depression）
B. 輕鬱性情感障礙症（dysthymic disorder）
C. 擬身體障礙症（somatoform disorder）
D. 焦慮症（anxiety disorder）

正確答案：B. 輕鬱性情感障礙症（dysthymic disorder）